Clinical trial inclusion criterion:
Age >=19 patients who complained of dizziness

Annotated entities:
- Person: "Age"
- Value: ">=19"
- Condition: "dizziness"